Patients on antibiotics.

The above is a clinical trial exclusion criterion. Annotated with entity spans:
Patients on [Drug: antibiotics].